一位懷孕 16 週之婦女到婦產科門診接受例行產前檢查，其平均紅血球容積（mean corpuscular volume, MCV）值為 72 fL，血紅素值為 12.3 g/dL，ferritin 值為 102 ng/mL，血紅素電泳結果 HbA 98%， 2%。接下來最適當的處理方式為：
A. 建議該婦女接受基因晶片檢查
B. 建議該婦女接受血液染色體檢查
C. 建議該婦女的配偶接受血液學檢查（complete blood count）及血紅素電泳
D. 建議該婦女的父母親及兄弟姊妹接受血液學檢查（complete blood count）及血紅素電泳

正確答案：C. 建議該婦女的配偶接受血液學檢查（complete blood count）及血紅素電泳